Clinical trial exclusion criterion:
Patients with any active infection including HBV, HCV and HIV.

Entity relations:
- Subsumes("active infection", "HBV")
- OR("HBV", "HCV", "HIV")